ASA 1-3

The above is a clinical trial inclusion criterion. Annotated with entity spans:
[Measurement: ASA] [Value: 1-3]